Clinical trial exclusion criterion:
8. Active Hepatitis A, Hepatitis B, or Hepatitis C infection

Annotated entities:
- Parsing_Error: "8."
- Condition: "Hepatitis A"
- Condition: "Hepatitis B"
- Condition: "Hepatitis C"